Infection or injury or a lesion at the block site.

The above is a clinical trial exclusion criterion. Annotated with entity spans:
[Condition: Infection] or [Condition: injury] or a [Condition: lesion] [Qualifier: at the block site].